Any disorder that compromises the ability of the patient to give written informed consent and/or comply with study procedures

The above is a clinical trial exclusion criterion. Annotated with entity spans:
Any [Condition: disorder] that [Negation: compromises the ability of] the patient to [Measurement: give written informed consent] and/or [Procedure: comply with study procedures]